Concomitant use with ergot-type oxytocic drugs

The above is a clinical trial exclusion criterion. Annotated with entity spans:
[Temporal: Concomitant] use with [Drug: ergot-type oxytocic drugs]